Clinical trial inclusion criteria:
Inpatients having major foot and ankle surgery that will benefit from continuous popliteal sciatic nerve block with an indwelling catheter
American Society Anesthesiologists (ASA) physical status I-III
18-85 years of age, inclusive
40-120 kg, inclusive
150 cm of height or greater

Annotated entities:
- Visit: "Inpatients"
- Procedure: "major foot and ankle surgery"
- Device: "indwelling catheter"
- Procedure: "popliteal sciatic nerve block"
- Qualifier: "continuous"
- Measurement: "American Society Anesthesiologists physical status"
- Measurement: "ASA"
- Value: "I-III"
- Person: "age"
- Value: "18-85 years"
- Person: "kg"
- Value: "40-120"
- Person: "height"
- Value: "150 cm or greater"